下列何者非造成昏厥（syncope）常見的機轉？
A. 血管張力（vascular tone）或血液容積（blood volume）的不足
B. 心律不整（cardiac arrhythmias）
C. 內耳病變（inner ear disorders）
D. 腦血管病變（cerebrovascular diseases）

正確答案：C. 內耳病變（inner ear disorders）